Clinical trial exclusion criterion:
Severe respiratory, digestive, hematological disease (including Anemia of Hb < 100 gram per litre) or tumor.

Entity relations:
- Has_qualifier("respiratory disease", "Severe")
- Has_value("Hb", "< 100 gram per litre")
- AND("Anemia", "Hb")
- Subsumes("respiratory disease", "Anemia")
- OR("respiratory disease", "digestive disease", "hematological disease")
- OR("respiratory disease", "tumor")